Patient who had been diagnosed within the previous 12 months with HbA1c levels of 8.0-12.0%, did not have a medical history related to diabetes, and did not display proliferative retinopathy

The above is a clinical trial inclusion criterion. Annotated with entity spans:
Patient who had been diagnosed within the [Temporal: previous 12 months] with [Measurement: HbA1c] levels of [Value: 8.0-12.0%], did [Negation: not] have a [Temporal: medical history related to diabetes], and did [Negation: not] display [Condition: proliferative retinopathy]